Clinical trial exclusion criterion:
Patients with any other primary DSM-IV psychiatric diagnosis in addition to Obsessive Compulsive Disorder.

Entity relations:
- Has_negation("Obsessive Compulsive Disorder", "in addition to")
- AND("psychiatric diagnosis", "Obsessive Compulsive Disorder")
- Has_qualifier("psychiatric diagnosis", "any other")
- Has_qualifier("psychiatric diagnosis", "primary")
- Has_qualifier("psychiatric diagnosis", "DSM-IV")